Clinical trial exclusion criterion:
Uncontrollable hypotension when upright

Entity relations:
- Has_qualifier("hypotension", "Uncontrollable")
- Has_qualifier("hypotension", "when upright")